Total bilirubin less than 1.5 x ULN. NOTE: If the potential participant is taking an indinavir (IDV)- or atazanavir (ATV)-containing regimen at the time of screening, total bilirubin less than or equal to 5 x ULN is acceptable.

The above is a clinical trial inclusion criterion. Annotated with entity spans:
[Measurement: Total bilirubin] [Value: less than 1.5 x ULN]. NOTE: If the potential participant is taking an [Drug: indinavir (IDV)]- or [Drug: atazanavir (ATV)]-containing [Procedure: regimen] [Temporal: at the time of screening], [Measurement: total bilirubin] [Value: less than or equal to 5 x ULN] is acceptable.